What is the function of the chromHMM software?

The ChromHMM software is a tool for learning chromatin-state signatures. It allows you to learn chromatin states, and then use that knowledge to make an annotated chromatin state for a cell type.